Subjects who donated >450 mL of blood within 60 days prior to any blood collection visits.

The above is a clinical trial exclusion criterion. Annotated with entity spans:
Subjects who [Procedure: donated] [Value: >450 mL] of blood [Temporal: within 60 days prior to any blood collection visits].